Obstructed outlet syndrome (objectified by defeacography)

The above is a clinical trial exclusion criterion. Annotated with entity spans:
[Condition: Obstructed outlet syndrome] (objectified by [Procedure: defeacography])